Capacity for understanding and signing in the Informed Consent Form;

The above is a clinical trial inclusion criterion. Annotated with entity spans:
[Post-eligibility: Capacity for understanding and signing in the Informed Consent Form;]